Clinical trial exclusion criteria:
Vaccination against pneumococcal infection in anamnesis;
Application of preparations of immune globulin or blood transfusion within last three months prior to clinical studies;
Prolonged use (more than 14 days) immunosuppressants or other immunosuppressive drugs within 6 months prior to the start of the study;
Any confirmed or suspected immunosuppressive or immunodeficient condition, including HIV infection;
A history or currently hematologic and other cancers;
A positive reaction for HIV infection, viral hepatitis B and hepatitis C;
The presence of respiratory, cardio-vascular insufficiency, impaired liver and kidney function, established during a physical examination at visit number 1;
Pronounced congenital defects or serious chronic diseases in the acute stage, including any clinically important exacerbation of chronic diseases of the liver, kidney, cardiovascular, nervous system, mental diseases or metabolic disorders, confirmed by the history or objective examination (pulmonary: cystic fibrosis, lung abscess, empyema, active tuberculosis; extra-pulmonary: congestive heart failure, malabsorption, chronic renal and hepatic failure, cirrhosis, malignancy, immunodeficiency, cirrhosis of the liver);
Severe allergic reactions in anamnesis of autoimmune disease;
The presence of acute infectious and/or communicable illnesses within 1 month prior to study;
History of chronic alcohol abuse and/or drug use;
Exacerbation of chronic diseases;
Breastfeeding;
Pregnancy;
Participation in any other clinical study within the last 3 months.

Annotated entities:
- Condition: "pneumococcal infection"
- Procedure: "Vaccination"
- Drug: "preparations of immune globulin"
- Procedure: "blood transfusion"
- Temporal: "within last three months prior to clinical studies"
- Temporal: "more than 14 days"
- Temporal: "Prolonged use"
- Drug: "immunosuppressants"
- Qualifier: "other"
- Drug: "immunosuppressive drugs"
- Temporal: "within 6 months prior to the start of the study"
- Condition: "immunosuppressive condition"
- Condition: "immunodeficient condition"
- Condition: "HIV infection"
- Non-representable: "A history or currently hematologic and other cancers;"
- Measurement: "reaction for HIV infection"
- Value: "positive"
- Measurement: "reaction for viral hepatitis B"
- Measurement: "reaction for hepatitis C"
- Condition: "cardio-vascular insufficiency"
- Condition: "respiratory insufficiency"
- Condition: "impaired liver"
- Condition: "impaired kidney function"
- Temporal: "at visit number 1"
- Condition: "congenital defects"
- Condition: "chronic diseases"
- Qualifier: "acute stage"
- Qualifier: "clinically important"
- Qualifier: "serious"
- Condition: "exacerbation"
- Condition: "diseases of the liver"
- Qualifier: "chronic"
- Condition: "diseases of the kidney"
- Condition: "diseases of the cardiovascular system"
- Condition: "diseases of the nervous system"
- Condition: "mental diseases"
- Condition: "metabolic disorders"
- Condition: "cystic fibrosis"
- Condition: "lung abscess"
- Condition: "empyema"
- Qualifier: "active"
- Condition: "tuberculosis"
- Condition: "congestive heart failure"
- Condition: "malabsorption"
- Condition: "hepatic failure"
- Condition: "renal failure"
- Qualifier: "chronic"
- Condition: "cirrhosis"
- Condition: "malignancy"
- Condition: "immunodeficiency"
- Condition: "cirrhosis of the liver"
- Qualifier: "Severe"
- Condition: "allergic reactions"
- Qualifier: "acute"
- Condition: "infectious illnesses"
- Condition: "communicable illnesses"
- Temporal: "within 1 month prior to study"
- Reference_point: "study"
- Condition: "alcohol abuse"
- Condition: "drug use"
- Qualifier: "chronic"
- Condition: "Exacerbation"
- Condition: "chronic diseases"
- Observation: "Breastfeeding"
- Condition: "Pregnancy"
- Observation: "Participation in clinical study"
- Qualifier: "any other"
- Temporal: "within the last 3 months"